癌症末期疼痛治療的原則，下列敘述何者錯誤？
A. 經口給藥是使用止痛藥的優先考慮途徑
B. 以「疼痛時才給藥」的處方方式為原則
C. 適時使用輔助藥物
D. 使用正確的藥物品項及劑量，與正確的時間間隔，大多數的癌痛，可以得到緩解

正確答案：B. 以「疼痛時才給藥」的處方方式為原則